Clinical trial inclusion criterion:
Patients with Ph (BCR/ABL) positive de novo < 55 years old (it is advisable to include patients over 55 years LAL07OPH protocol).

Entity relations:
- Has_value("Ph (BCR/ABL)", "positive")
- Has_qualifier("Ph (BCR/ABL)", "de novo")
- Has_value("old", "< 55 years")